Clinical trial inclusion criterion:
traumatic spinal cord injury at least one year ago

Annotated entities:
- Condition: "traumatic spinal cord injury"
- Temporal: "at least one year ago"